黴菌感染之鼻竇炎引發併發症的病例中，下列何者為最典型之徵象？
A. 血管破裂
B. 血管栓塞
C. 骨髓侵犯
D. 肌肉溶解

正確答案：B. 血管栓塞